Clinical trial inclusion criterion:
pre-diabetic

Annotated entities:
- Condition: "pre-diabetic"